Clinical trial inclusion criterion:
Subjects who are within their ideal body weight (BMI between >17 and =28 kg/m2)

Annotated entities:
- Measurement: "BMI"
- Value: "between >17 and =28 kg/m2"